Clinical trial exclusion criterion:
21. Has any other factor which may, in the opinion of the investigator, compromise participation and/or follow-up in the study

Annotated entities:
- Parsing_Error: "21."
- Subjective_judgement: "Has any other factor which may, in the opinion of the investigator, compromise participation and/or follow-up in the study"
- Context_Error: "Has any other factor which may, in the opinion of the investigator, compromise participation and/or follow-up in the study"
- Non-query-able: "Has any other factor which may, in the opinion of the investigator, compromise participation and/or follow-up in the study"